Clinical trial inclusion criterion:
Willing to use the NuvaRing as directed

Annotated entities:
- Observation: "Willing to use"
- Drug: "NuvaRing"